下列何種抑癌基因（tumor suppressor gene）功能與 DNA 的修補有關？
A. APC/ β-catenin
B. PTEN
C. RB1
D. BRCA1 及 BRCA2

正確答案：D. BRCA1 及 BRCA2